Clinical trial exclusion criterion:
Obstructive or restrictive pulmonary disease

Annotated entities:
- Condition: "restrictive pulmonary disease"
- Condition: "Obstructive pulmonary disease"